Which proteins compose the error prevention GO (8-oxo-G) system in Pseudomonas putida?

In P. putida (Pseudomonas putida) the error prevention GO (8-oxo-G) system is composed of MutY, MutM, and MutT enzymes.